Clinical trial inclusion criterion:
Age from 40 to 80 years old, either gender;

Entity relations:
- Has_value("Age", "from 40 to 80 years old")